Clinical trial exclusion criterion:
Treatment with oral contraceptives (unless a second form of birth control is used and documented)

Annotated entities:
- Drug: "oral contraceptives"
- Procedure: "Treatment"
- Observation: "birth control"
- Qualifier: "second form"
- Negation: "unless"